Clinical trial inclusion criterion:
Women age 18-45

Entity relations:
- Has_value("age", "18-45")